下列有關完全型房室墊缺損（endocardial cushion defect），又稱為 atrioventricular septal defect 之敘述，何者錯誤？
A. 於唐氏症（Down syndrome）孩童常見
B. 常合併房室瓣膜逆流（atrioventricular valve regurgitation）
C. 其心電圖除了右心室肥厚外，常可見 QRS 軸右偏至+120°～+180°
D. 常造成嬰幼兒肺高壓及心衰竭

正確答案：C. 其心電圖除了右心室肥厚外，常可見 QRS 軸右偏至+120°～+180°